Clinical trial exclusion criterion:
Unable to consent.

Annotated entities:
- Observation: "Unable to consent."